Uno de los tratamientos de primera línea para el trastorno ansiedad generalizada incluye el uso de un:
1. Modulador negativo del receptor GABA-A.
2. Antagonista parcial serotoninérgetico 1A.
3. Modulador negativo del recetor GABA-B.
4. Inhibidor selectivo de la recaptación de serotonina.

Respuesta correcta: 4. Inhibidor selectivo de la recaptación de serotonina.